Reference vessel size 2.5 mm by visual estimation

The above is a clinical trial inclusion criterion. Annotated with entity spans:
[Measurement: Reference vessel size] [Value: 2.5 mm] by visual estimation